Capable of understanding instructions and participating in the definition of a therapeutic goal (Boston Diagnostic Aphasia Examination (BDAE) < 3).

The above is a clinical trial inclusion criterion. Annotated with entity spans:
[Post-eligibility: Capable of understanding instructions and participating in the definition of a therapeutic goal] ([Measurement: Boston Diagnostic Aphasia Examination] ([Measurement: BDAE]) [Value: < 3]).